Clinical trial exclusion criterion:
Use of any oral antidiabetic treatment except for metformin (i.e., sulphonylureas, DPP-IV inhibitors, thiazolidinediones, SGLT-2 inhibitors (Sodium dependent glucose transporter) or GLP-1 analogues (glucagone like peptide) within the last three months prior to Screening

Entity relations:
- multi("oral antidiabetic treatment", "oral antidiabetic")
- Has_negation("metformin", "except for")
- AND("oral antidiabetic treatment", "metformin")
- Has_index("within the last three months prior to Screening", "Screening")
- Subsumes("oral antidiabetic treatment", "sulphonylureas")
- Has_temporal("oral antidiabetic treatment", "within the last three months prior to Screening")
- OR("sulphonylureas", "thiazolidinediones", "SGLT-2 inhibitors", "GLP-1 analogues", "DPP-IV inhibitors")